Clinical trial exclusion criterion:
Coexisting malignancy

Annotated entities:
- Condition: "malignancy"
- Qualifier: "Coexisting"